Easten Cooperative Oncology Group score = 2

The above is a clinical trial inclusion criterion. Annotated with entity spans:
[Measurement: Easten Cooperative Oncology Group score] [Value: = 2]